child took any antihistamine in the past three days [including diphenhydramine (Benadryl®), cetirizine (Zyrtec®), loratadine (Claritin®), fexofenadine (Allegra®), levocetirizine (Xyzal®), and desloratadine (Clarinex®)] or

The above is a clinical trial exclusion criterion. Annotated with entity spans:
child took any [Drug: antihistamine] [Temporal: in the past three days] [including [Drug: diphenhydramine] ([Drug: Benadryl]®), [Drug: cetirizine] ([Drug: Zyrtec]®), [Drug: loratadine] ([Drug: Claritin]®), [Drug: fexofenadine] ([Drug: Allegra]®), [Drug: levocetirizine] ([Drug: Xyzal]®), and [Drug: desloratadine] ([Drug: Clarinex]®)] or